Señale la afirmación FALSA:
1. La sintomatología predominante en las intoxicaciones por paracetamol es la hepatotoxicidad.
2. El lavado gástrico no está indicado como medida terapéutica en el manejo de la intoxicación aguda por paracetamol.
3. La piedra angular en el tratamiento de la intoxicación por paracetamol es su antídoto específico, la N-acetilcisteina.
4. La descontaminación gastrointestinal mediante la administración de carbón activado está indicada si han transcurrido menos de 4 horas de la ingesta de paracetamol a dosis tóxica o desconocida.

Respuesta correcta: 4. La descontaminación gastrointestinal mediante la administración de carbón activado está indicada si han transcurrido menos de 4 horas de la ingesta de paracetamol a dosis tóxica o desconocida.